Active vaginal bleeding

The above is a clinical trial exclusion criterion. Annotated with entity spans:
[Condition: Active vaginal bleeding]